A los compuestos de organomagnesio se les denomina comúnmente reactivos de:
1. Lipshutz.
2. Birch.
3. Grignard.
4. Noyori.
5. Blanc.

Respuesta correcta: 3. Grignard.